Patient with primary pulmonary hypertension (i.e. Idiopathic Pulmonary Arterial Hypertension or Familial Pulmonary Arterial Hypertension) and classified as NYHA functional class III (NYHA = New York Heart Association)

The above is a clinical trial inclusion criterion. Annotated with entity spans:
Patient with [Condition: primary pulmonary hypertension] (i.e. [Condition: Idiopathic Pulmonary Arterial Hypertension] or [Condition: Familial Pulmonary Arterial Hypertension]) and classified as [Measurement: NYHA functional class] [Value: III] (NYHA = New York Heart Association)